通常什麼年齡出現第一次恐慌症狀發作，須特別考慮可能合併有內、外科疾患？
A. 兒童期
B. 青少年期
C. 25～35 歲
D. 45 歲以上

正確答案：D. 45 歲以上